有關軟骨的敘述，下列何者錯誤？
A. 透明軟骨（hyaline cartilage）具有軟骨細胞（chondrocyte）與軟骨膜（perichondrium）
B. 纖維軟骨（fibrocartilage）具有軟骨母細胞（chondroblast）與軟骨膜（perichondrium）
C. 彈性軟骨（elastic cartilage）具有軟骨細胞（chondrocyte）與軟骨母細胞（chondroblast）
D. 纖維軟骨（fibrocartilage）具有軟骨細胞（chondrocyte）與纖維母細胞（fibroblast）

正確答案：B. 纖維軟骨（fibrocartilage）具有軟骨母細胞（chondroblast）與軟骨膜（perichondrium）